Clinical trial exclusion criterion:
Evidence of current hepatitis C virus infection (HCV) (ie, HCV antibody [Ab] positive within 90 days prior to study entry unless also shown to be plasma HCV RNA negative within the same time period)

Annotated entities:
- Temporal: "current"
- Condition: "hepatitis C virus infection (HCV)"
- Measurement: "HCV antibody [Ab]"
- Value: "positive"
- Mood: "Evidence"
- Temporal: "within 90 days prior to study entry"
- Measurement: "plasma HCV RNA"
- Value: "negative"
- Temporal: "within the same time period"